下列有關玫瑰糠疹（pityriasis rosea）的敘述，何者正確？
A. 好發於臉部及肢端
B. 病因可能與 human herpes virus type 7 感染有關
C. 容易反覆發作
D. 皮膚病理以慢性皮膚炎之表現為主

正確答案：B. 病因可能與 human herpes virus type 7 感染有關